特定疾病或狀況，容易造成兒童阻塞性呼吸暫停（obstructive sleep apnea）或換氣不足（hypoventilation），導致睡眠障礙、生長不良，甚至腦缺氧，下列何者最不可能？
A. achondroplasia合併midface hypoplasia
B. 腭裂（cleft palate）尚未經手術修補
C. Pierre-Robin sequence合併 micrognathia
D. Prader-Willi syndrome併發肥胖（obesity）

正確答案：B. 腭裂（cleft palate）尚未經手術修補